Neostigmine 會增強下列何種神經肌肉阻斷劑的作用？
A. Succinylcholine
B. Pancuronium
C. d-Tubocurarine
D. Gallamine

正確答案：A. Succinylcholine